Clinical trial inclusion criterion:
Age 1-59 months,

Entity relations:
- Has_value("Age", "1-59 months")